Los ritmos circadianos se establecen en:
1. Glándula pineal.
2. Núcleo supraquiasmático.
3. Retina.
4. Médula espinal.
5. Núcleo centromediano talámico.

Respuesta correcta: 2. Núcleo supraquiasmático.